Which conditions is caused by mutations in HFE?

Mutations in the HFE gene, encoding the syntaxin binding protein HFE1, are the cause of hereditary hemochromatosis.